Clinical trial inclusion criterion:
Sonographic diagnosis of ovarian endometrioma with diameter at least 4cm on 2 separate scans at least 6 weeks apart

Annotated entities:
- Procedure: "Sonographic"
- Condition: "ovarian endometrioma"
- Qualifier: "diameter at least 4cm"
- Multiplier: "2 separate scans"
- Temporal: "at least 6 weeks apart"